以NaOH強鹼滴定含有甘胺酸（glycine）的溶液，在pH＝12時，完成滴定過程，此時甘胺酸的主要化學式為何？
A. NH3+-CH2-COOH
B. NH2-CH2-COO-
C. NH2-CH3+-COO-
D. NH3+-CH2-COO-

正確答案：B. NH2-CH2-COO-